Clinical trial inclusion criterion:
Blood pressure <140/90 mmHg at Screening and D-1. Measurement may be repeated within 24 hours, based on Investigator judgment.

Entity relations:
- Has_index("at Screening and D-1", "Screening and D-1")
- Has_value("Blood pressure", "<140/90 mmHg")
- Has_temporal("Blood pressure", "at Screening and D-1")